Clinical trial exclusion criterion:
4. Have severe liver disease, kidney disease or cancer;

Annotated entities:
- Qualifier: "severe"
- Condition: "liver disease"
- Condition: "kidney disease"
- Condition: "cancer"